Male participants between 18 and 40 years-old

The above is a clinical trial inclusion criterion. Annotated with entity spans:
[Person: Male] participants [Value: between 18 and 40 years]-[Person: old]